Clinical trial exclusion criterion:
use of concurrent,non-stimulant psychoactive medication

Entity relations:
- Has_temporal("non-stimulant psychoactive medication", "concurrent")